Clinical trial inclusion criteria:
major elective gastrointestinal, gynecological, prostate or bladder surgery patients who are = 60 years old.
the surgery is laparoscopic surgery and is expected to last for = 2 hours under general anesthesia and the patient will stay in hospital for at least 7 days after surgery.
lack of serious hearing and vision impairment and be able to read so that neurobehavioral tests can be performed.

Annotated entities:
- Qualifier: "elective"
- Procedure: "gastrointestinal surgery"
- Procedure: "bladder surgery"
- Procedure: "prostate surgery"
- Procedure: "gynecological surgery"
- Value: "= 60 years old"
- Person: "old"
- Procedure: "laparoscopic surgery"
- Measurement: "last"
- Value: "= 2 hour"
- Mood: "expected"
- Qualifier: "under general anesthesia"
- Mood: "will"
- Procedure: "stay in hospital"
- Value: "at least 7 days after surgery"
- Negation: "lack of"
- Condition: "vision impairment"
- Condition: "hearing impairment"
- Condition: "able to read"
- Procedure: "neurobehavioral tests"
- Mood: "can be performed"